Clinical trial exclusion criterion:
Active psychiatric disease (psychotic illness, major depression, or acute anxiety attacks) which prevents subject compliance with the requirements of the investigational study testing

Entity relations:
- AND("psychiatric disease", "psychotic illness")
- OR("psychotic illness", "major depression", "acute anxiety attacks")